有關貓抓病（Cat-scratch disease）的描述，何者錯誤？
A. 引起貓抓病的致病菌是 Pasteurella multocida
B. 臨床表現常有局部的淋巴結腫大
C. 症狀可持續數週甚至數個月
D. 大部分的病人不會引起發燒

正確答案：A. 引起貓抓病的致病菌是 Pasteurella multocida